Para mejorar la adherencia al tratamiento en un paciente bipolar podemos realizar un contrato conductual, ¿Cuál de los siguientes aspectos NO se recomienda incluir en ese contrato?:
1. La definición de los objetivos del tratamiento.
2. Las recompensas externas por la adherencia al tratamiento.
3. Los factores que podrían interferir con el tratamiento.
4. Los planes para reducir los obstáculos a la adherencia.

Respuesta correcta: 2. Las recompensas externas por la adherencia al tratamiento.